下列何種抗心律不整藥物是屬於 Class IB，適用於 ventricular tachyarrhythmias 病人？
A. Propranolol
B. Mexiletine
C. Propafenone
D. Amiodarone

正確答案：B. Mexiletine